Clinical trial inclusion criterion:
With uni-dimensionally measurable disease (at least longest diameter 2 cm on conventional CT scan, x-ray or physical examination, or 1cm on spiral CT scan)

Entity relations:
- Has_qualifier("disease", "uni-dimensionally measurable")
- AND("conventional CT scan", "longest diameter")
- Has_value("longest diameter", "at least 2 cm")
- Has_value("longest diameter", "at least 1cm")
- AND("spiral CT scan", "longest diameter")
- Subsumes("uni-dimensionally measurable", "conventional CT scan")
- OR("conventional CT scan", "physical examination", "spiral CT scan", "x-ray")